Clinical trial inclusion criterion:
American Society Anesthesiologists (ASA) physical status I-III

Entity relations:
- Subsumes("American Society Anesthesiologists physical status", "ASA")
- Has_value("American Society Anesthesiologists physical status", "I-III")